Clinical trial exclusion criterion:
Patient not expected to survive more than 4 days

Entity relations:
- Has_value("survive", "more than 4 days")
- Has_negation("more than 4 days", "not")